Clinical trial inclusion criterion:
Patients without prostatectomy: 2 consecutive rises in PSA levels relative to a previous reference value, separated by one month. The first measurement must occur one month after the reference value and must be above the reference value. The second confirmatory measurement taken one month after the first measurement must be greater than the first measurement.

Entity relations:
- Has_temporal("2", "consecutive")
- Has_value("2", "rises")
- Has_value("PSA levels", "rises")
- Has_temporal("2", "separated by one month")
- AND("first", "measurement")
- Has_temporal("measurement", "one month after the reference value")
- Has_value("measurement", "above the reference value")
- AND("second", "measurement")
- Has_temporal("measurement", "one month after the first measurement")
- Has_value("measurement", "greater than the first measurement")